Inclusion in another study in the last 2 months.

The above is a clinical trial exclusion criterion. Annotated with entity spans:
[Context_Error: Inclusion in another study] [Temporal: in the last 2 months].